Clinical trial exclusion criterion:
Debilitating stroke within 90 days before inclusion

Entity relations:
- Has_temporal("stroke", "within 90 days before inclusion")
- AND("stroke", "Debilitating")